Clinical trial exclusion criterion:
Use of antipsychotics or mood stabilizers within 5 days prior to screening.

Annotated entities:
- Drug: "antipsychotics"
- Drug: "mood stabilizers"
- Temporal: "within 5 days prior to screening"
- Reference_point: "screening"